Memantine可用於治療阿兹海默症（Alzheimer's disease），下列何者為該藥可能的藥理作用機轉？
A. 抑制muscarine受體
B. 抑制dopamine受體
C. 抑制NMDA受體
D. 抑制GABAA受體

正確答案：C. 抑制NMDA受體